Clinical trial exclusion criterion:
12. Current use of fibrates, including fenofibrates, or simvastatin

Annotated entities:
- Parsing_Error: "12."
- Drug: "fibrates"
- Temporal: "Current"
- Drug: "fenofibrates"
- Drug: "simvastatin"